Clinical trial inclusion criterion:
Ex-smokers over five years;

Annotated entities:
- Condition: "Ex-smokers"
- Temporal: "over five years"